下列何者不能做為酵素執行酸- 鹼催化（acid-base catalysis）時的活性中心胺基酸（active site residue）？
A. 組胺酸（histidine）
B. 甲硫胺酸（methionine）
C. 天門冬胺酸（aspartic acid）
D. 麩胺酸（glutamic acid）

正確答案：B. 甲硫胺酸（methionine）